俗稱「媽媽手」的腕部肌腱炎，稱作DeQuervain氏症，是腕部六個伸肌腱腔室（compartment）中最靠橈側的第一腔室內的肌腱發炎。這包括下列那一條肌腱？
A. 橈側伸腕短肌腱（extensor carpi radialis brevis tendon）
B. 橈側伸腕長肌腱（extensor carpi radialis longus tendon）
C. 拇指伸展長肌腱（extensor pollicis longus tendon）
D. 拇指外展長肌腱（abductor pollicis longus tendon）

正確答案：D. 拇指外展長肌腱（abductor pollicis longus tendon）